Able to ambulate a few steps with or without an assistive device

The above is a clinical trial inclusion criterion. Annotated with entity spans:
[Condition: Able to ambulate a few steps] [Qualifier: with] or [Qualifier: without an assistive device]